Clinical trial exclusion criterion:
Painful active, concurrent cervical spine conditions

Entity relations:
- AND("Painful", "cervical spine conditions")